Clinical trial exclusion criterion:
Tromboembolic event (CVA or transient ischemic attack, AMI) less than 3 months prior to the intravitreal injection of bevacizumab

Annotated entities:
- Condition: "Tromboembolic event"
- Condition: "CVA"
- Condition: "transient ischemic attack"
- Condition: "AMI"
- Temporal: "less than 3 months prior to the intravitreal injection of bevacizumab"
- Procedure: "intravitreal injection"
- Drug: "bevacizumab"
- Reference_point: "the intravitreal injection of bevacizumab"